Clinical trial exclusion criterion:
Any condition that, in the opinion of the study physician, makes it medically inappropriate or risky for the patient to enroll in the trial

Annotated entities:
- Post-eligibility: "Any condition that, in the opinion of the study physician, makes it medically inappropriate or risky for the patient to enroll in the trial"